La ranitidina es un antiulceroso de la familia de los antagonistas H2 que contiene en su estructura un heterociclo:
1. Imidazólico.
2. Furánico.
3. Tiazólico.
4. Piperidínico.

Respuesta correcta: 2. Furánico.